What is the effect of thapsigargin treatment?

Thapsigargin is an endoplasmic stress inducer. 	It is a sarcoplasmic/endoplasmic Ca(2+)-ATPase (SERCA) inhibitor.